What is cluster of differentiation?

Cluster of Differentiation (CD) are cellular antigens used to identify cell populations, such as T-lymphocyte populations and macrophages.